Clinical trial inclusion criterion:
onset of diabetes after age 30

Annotated entities:
- Measurement: "onset of diabetes"
- Value: "after age 30"